Clinical trial inclusion criterion:
Patients experiencing an average weekly pain intensity score greater than 4 on a 11 points NRS

Annotated entities:
- Measurement: "average weekly pain intensity score on a 11 points NRS"
- Value: "greater than 4"